Clinical trial exclusion criterion:
Serum phosphate <3.0 mg/dL

Annotated entities:
- Measurement: "Serum phosphate"
- Value: "<3.0 mg/dL"